Active bleeding without control;

The above is a clinical trial exclusion criterion. Annotated with entity spans:
[Qualifier: Active] [Condition: bleeding] without control;